El genoma del virus de la hepatitis B es DNA de:
1. Cadena simple (+).
2. Cadena simple (-).
3. Doble cadena circular.
4. Doble cadena lineal.
5. Doble cadena circular incompleta (con muescas).

Respuesta correcta: 5. Doble cadena circular incompleta (con muescas).